2. Patients who have received prior adjuvant therapy for early-stage lung cancer are eligible if at least 12 months have elapsed from that treatment.

The above is a clinical trial inclusion criterion. Annotated with entity spans:
2. Patients who have received prior [Procedure: adjuvant therapy] for [Condition: early-stage lung cancer] are eligible if [Temporal: at least 12 months have elapsed from that treatment].